Clinical trial exclusion criterion:
Patients receiving therapeutic heparin medication due to chronic coagulation disease / anticoagulation medication (i.e. partial thromboplastin time > 60 sec)

Annotated entities:
- Drug: "heparin"
- Condition: "chronic coagulation disease"
- Drug: "anticoagulation medication"
- Measurement: "partial thromboplastin time"
- Value: "> 60 sec"